Clinical trial exclusion criterion:
Patients taking any experimental therapies history of another malignancy within 5 years prior to study entry except curatively treated non-melanoma skin cancer, prostate cancer, or cervical cancer in situ

Annotated entities:
- Condition: "another malignancy"
- Temporal: "within 5 years prior to study entry"
- Condition: "non-melanoma skin cancer"
- Qualifier: "curatively treated"
- Condition: "prostate cancer"
- Condition: "cervical cancer in situ"
- Temporal: "history of"
- Negation: "except"
- Non-representable: "Patients taking any experimental therapies"